Clinical trial exclusion criterion:
no informed consent

Annotated entities:
- Non-query-able: "no informed consent"